Clinical trial exclusion criterion:
Has an active autoimmune disease that has required systemic treatment in the past 2 years. Replacement therapy is not considered a form of systemic treatment.

Annotated entities:
- Temporal: "active"
- Condition: "autoimmune disease"
- Procedure: "systemic treatment"
- Temporal: "in the past 2 years"
- Not_a_criteria: "Replacement therapy is not considered a form of systemic treatment."